Refusal to sign an informed consent form to participate in this study, and sign the hospital information release form, if applicable

The above is a clinical trial exclusion criterion. Annotated with entity spans:
[Observation: Refusal to] [Informed_consent: sign an informed consent form] to participate in this study, and [Informed_consent: sign the hospital information release form], if applicable